Clinical trial exclusion criterion:
People with any type of implantable device

Annotated entities:
- Device: "implantable device"